Clinical trial inclusion criterion:
Creatinine clearance more or equal to 30 mL/min

Entity relations:
- Has_value("Creatinine clearance", "more or equal to 30 mL/min")